Patient is currently enrolled in another clinical trial

The above is a clinical trial exclusion criterion. Annotated with entity spans:
Patient is [Temporal: currently] [Observation: enrolled in another clinical trial]